Clinical trial exclusion criterion:
contra indication to dexamethasone

Entity relations:
- AND("contra indication", "dexamethasone")